Los neumocitos tipo I:
1. Producen surfactante.
2. Dan lugar a los neumocitos tipo II.
3. Tienen gran cantidad de orgánulos.
4. Son responsables del intercambio gaseoso.
5. Son células mesenquimales.

Respuesta correcta: 4. Son responsables del intercambio gaseoso.